Clinical trial exclusion criterion:
9. Intention to treat more than 1 totally occluded major epicardial vessel;

Entity relations:
- Has_multiplier("totally occluded major epicardial vessel", "more than 1")
- Has_qualifier("treat", "totally occluded major epicardial vessel")
- Has_mood("treat", "Intention to")